Clinical trial exclusion criteria:
using daily medication for chronic condition
acute narrow angle glaucoma
previous adverse experience with study drugs
experiences motion sickness in response to driving simulator
BMI > 30
women who are pregnant, lactating, or planning on becoming pregnant
regular use of tobacco products
current substance use disorder
clinically significant ECG
current ongoing psychiatric disorder

Annotated entities:
- Multiplier: "daily"
- Drug: "medication"
- Condition: "chronic condition"
- Qualifier: "acute"
- Condition: "narrow angle glaucoma"
- Temporal: "previous"
- Condition: "adverse experience"
- Drug: "study drugs"
- Condition: "motion sickness"
- Measurement: "BMI"
- Value: "> 30"
- Person: "women"
- Condition: "pregnant"
- Condition: "lactating"
- Mood: "planning on becoming"
- Condition: "pregnant"
- Multiplier: "regular"
- Observation: "use of tobacco products"
- Temporal: "current"
- Condition: "substance use disorder"
- Qualifier: "clinically significant"
- Procedure: "ECG"
- Temporal: "current"
- Temporal: "ongoing"
- Condition: "psychiatric disorder"